Clinical trial exclusion criterion:
Renal disease,

Annotated entities:
- Condition: "Renal disease"